Clinical trial exclusion criterion:
triptans

Annotated entities:
- Drug: "triptans"